Clinical trial exclusion criteria:
Previous treated with anti-diabetic medication
Pregnant or nursing women.
Impaired liver function (ALT > 120 U/L)
Impaired renal function (Serum creatinine >1.5 mg/dL in male, >1.4 mg/dL in female )
Recently suffered from MI or CVA.
Patients are acute intercurrent illness.
2-hour C-peptide level < 1.8 ng/mL.

Annotated entities:
- Drug: "anti-diabetic medication"
- Temporal: "Previous"
- Procedure: "treated"
- Condition: "Pregnant"
- Condition: "nursing"
- Person: "women"
- Condition: "Impaired liver function"
- Measurement: "ALT"
- Value: "> 120 U/L"
- Condition: "Impaired renal function"
- Measurement: "Serum creatinine"
- Value: ">1.5 mg/dL"
- Person: "male"
- Person: "female"
- Value: ">1.4 mg/dL"
- Condition: "MI"
- Condition: "CVA"
- Temporal: "Recently"
- Condition: "acute intercurrent illness"
- Measurement: "2-hour C-peptide level"
- Value: "< 1.8 ng/mL"